on medication e.g. steroid, multivitamins, thiamine-containing vitamins, diuretic drugs

The above is a clinical trial exclusion criterion. Annotated with entity spans:
on medication e.g. [Drug: steroid], [Drug: multivitamins], [Drug: thiamine-containing vitamins], [Drug: diuretic drugs]